21. Renal or hepatic insufficiency

The above is a clinical trial exclusion criterion. Annotated with entity spans:
[Parsing_Error: 21.] [Condition: Renal] or [Condition: hepatic insufficiency]